Clinical trial inclusion criterion:
Recently commenced psychotherapy (within four weeks of study entry)

Entity relations:
- Subsumes("Recently", "within four weeks of study entry")
- Has_temporal("psychotherapy", "Recently")